關於臭氧敘述，下列何者錯誤？
A. 大多為直接由污染源排放之一級污染物
B. 夏天午後空氣中的臭氧濃度較其他時間高，尤其在工業區與都會區更為明顯
C. 平流層臭氧濃度太低，會增加紫外線暴露
D. 可以用於室內空氣品質之改善

正確答案：A. 大多為直接由污染源排放之一級污染物